Benzodiazepine 類鎮靜-催眠（sedative-hypnotic）用藥於體內作用速率之快慢主要取決於其脂溶性，試問下列那一種 benzodiazepine 類藥物投予時作用最快？
A. Diazepam
B. Chlordiazepoxide
C. Oxazepam
D. Lorazepam

正確答案：A. Diazepam